Clinical trial exclusion criterion:
HYPERTENSIVE: known cardiovascular disease or risk factors aside from hypertension or use of cardiac medications

Entity relations:
- Has_negation("cardiovascular risk factors from hypertension", "aside from")
- AND("HYPERTENSIVE", "cardiovascular risk factors from hypertension")
- AND("HYPERTENSIVE", "cardiovascular disease")
- OR("cardiovascular disease", "cardiovascular risk factors")
- OR("cardiovascular disease", "cardiac medications")
- OR("cardiovascular risk factors from hypertension", "cardiac medications")